Additional congenital gastrointestinal abnormalities requiring surgical intervention

The above is a clinical trial exclusion criterion. Annotated with entity spans:
[Qualifier: Additional] [Qualifier: congenital] [Condition: gastrointestinal abnormalities] [Mood: requiring] [Procedure: surgical intervention]